成年人慢性鉛中毒，在神經系統最容易引起下列何種症狀或病變？
A. 失智症（Dementia）
B. 小腦萎縮導致運動失調（Cerebellar ataxia）
C. 巴金森氏症（Parkinsonism）
D. 周邊神經病變（Peripheral neuropathy）

正確答案：D. 周邊神經病變（Peripheral neuropathy）